Known allergy or hypersensitivity to escitalopram or bupropion

The above is a clinical trial exclusion criterion. Annotated with entity spans:
Known [Condition: allergy] or [Condition: hypersensitivity] to [Drug: escitalopram] or [Drug: bupropion]